Clinical trial inclusion criterion:
Hgb =8.5 g/dL and =11.5 g/dL

Entity relations:
- Has_value("Hgb", "=8.5 g/dL and =11.5 g/dL")